Clinical trial exclusion criterion:
Total bilirubin >= 2 x ULN

Annotated entities:
- Measurement: "Total bilirubin"
- Value: ">= 2 x ULN"